Clinical trial inclusion criterion:
Patient or legally authorized representative provides written informed consent to enroll in this study

Annotated entities:
- Informed_consent: "Patient or legally authorized representative provides written informed consent to enroll in this study"